細胞在無氧狀態下（anaerobic condition）進行葡萄糖糖解作用（glycolysis）時，下列相關敘述何者正確？
A. 可進行完整的糖解作用，產生兩分子乳酸（lactate）
B. 僅能生成NADH，但不會產生ATP
C. 能同時生成ATP及NADH
D. 無法進行糖解作用

正確答案：A. 可進行完整的糖解作用，產生兩分子乳酸（lactate）